下列何種抗凝血劑屬於直接作用於thrombin之抑制劑？
A. heparin
B. enoxaparin
C. fondaparinux
D. argatroban

正確答案：D. argatroban